Patients who already received oral vancomycin or metronidazole (either oral or intravenous) for > 24 hours within the preceding 72 hours at the time of enrollment.

The above is a clinical trial exclusion criterion. Annotated with entity spans:
Patients who already received [Qualifier: oral] [Drug: vancomycin] or [Drug: metronidazole] (either oral or intravenous) for [Multiplier: > 24 hours] within the [Temporal: preceding 72 hours at the time of enrollment.]